Clinical trial inclusion criterion:
provide informed consent either personally or by an authorized representative.

Annotated entities:
- Informed_consent: "provide informed consent either personally or by an authorized representative"